Has a CL prescription outside the range of the available parameters of the study lenses.

The above is a clinical trial exclusion criterion. Annotated with entity spans:
Has a [Device: CL prescription] [Context_Error: outside the range of the available parameters of the study lenses].